Women who are pregnant or breast feeding

The above is a clinical trial exclusion criterion. Annotated with entity spans:
[Pregnancy_considerations: Women who are pregnant or breast feeding]